La activación de los barorreceptores arteriales causa:
1. Estimulación del centro presor bulbar.
2. Activación del parasimpático.
3. Aumento de la presión arterial.
4. Taquicardia.
5. Efecto inotrópico positivo.

Respuesta correcta: 2. Activación del parasimpático.